Male and females between ages 18-85 years

The above is a clinical trial inclusion criterion. Annotated with entity spans:
[Person: Male] and [Person: females] [Value: between] [Person: ages] 18-85 years